中風病人復健的目的為盡可能地恢復病人的自我獨立生活能力，下列敘述何者錯誤？
A. 在病情穩定的前提下，越早進行復健對長期預後越有幫助
B. 在病情穩定的前提下，利用輔具讓病人能下床活動（mobility training），以避免褥瘡、深層靜脈栓塞等併發症
C. 即使在臥床的情況之下，及早進行活動範圍訓練（range of motion training），可以避免肌肉痙攣、關節攣縮
D. 約束治療（restraint therapy）意指約束中風患側肢體，訓練健側肢體儘快適應一般日常活動的進行

正確答案：D. 約束治療（restraint therapy）意指約束中風患側肢體，訓練健側肢體儘快適應一般日常活動的進行